Clinical trial inclusion criterion:
no PROM

Entity relations:
- Has_negation("PROM", "no")